Clinical trial inclusion criterion:
HbA1c < 8.5%

Entity relations:
- Has_value("HbA1c", "< 8.5%")